Clinical trial exclusion criterion:
uncontrolled hypertension,

Entity relations:
- Has_qualifier("hypertension", "uncontrolled")